Clinically significant hallucinations for which either 1) the frequency of hallucinations as assessed by the NPI is 'Very frequently', or 2) the frequency of hallucinations as assessed by the NPI is 'Frequently' AND the severity of the hallucinations as assessed by the NPI is 'Moderate', or 'Marked'

The above is a clinical trial exclusion criterion. Annotated with entity spans:
[Qualifier: Clinically significant] [Condition: hallucinations] for which either 1) the [Multiplier: frequency of hallucinations] as assessed by the [Measurement: NPI] is '[Value: Very frequently]', or 2) the [Multiplier: frequency of hallucinations] as assessed by the [Measurement: NPI] is '[Value: Frequently]' AND the [Qualifier: severity of the hallucinations] as assessed by the [Measurement: NPI] is '[Value: Moderate]', or '[Value: Marked]'